關於 A 型肝炎，下列何者錯誤？
A. A 型肝炎在第二次世界大戰期間稱為「傳染性肝炎」
B. 基因體為單股 RNA，分類為小 RNA 病毒科（Picornaviridae），並定為第 71 型腸病毒
C. A 型肝炎病毒主要是經口傳染，潛伏期為 2-6 週。成年人感染 A 型肝炎病毒之症狀較年幼者明顯
D. A 型肝炎可用疫苗接種預防

正確答案：B. 基因體為單股 RNA，分類為小 RNA 病毒科（Picornaviridae），並定為第 71 型腸病毒